Clinical trial exclusion criterion:
The patient is participating in another study

Annotated entities:
- Competing_trial: "The patient is participating in another study"